What is anophthalmia?

Anophthalmia is the medical term for the absence of one or both eyes.